Clinical trial inclusion criterion:
Lobectomy or pneumonectomy

Annotated entities:
- Procedure: "Lobectomy"
- Procedure: "pneumonectomy"